Clinical trial exclusion criterion:
Patients deprived of their civic rights, in custody, or subject to a tutorial, judiciary or administrative decision.

Annotated entities:
- Condition: "deprived of their civic rights"
- Condition: "in custody"
- Condition: "subject to a tutorial"
- Condition: "subject to a judiciary decision"
- Condition: "subject to administrative decision"